Clinical trial inclusion criterion:
Absolute neutrophil count (ANC) greater than or equal to 500/mm^3

Annotated entities:
- Measurement: "Absolute neutrophil count (ANC)"
- Value: "greater than or equal to 500/mm^3"